Clinical trial inclusion criterion:
Serum intact parathyroid hormone =600 pg/mL

Entity relations:
- Has_value("Serum intact parathyroid hormone", "=600 pg/mL")